Ability and willingness to take oral study medications

The above is a clinical trial inclusion criterion. Annotated with entity spans:
[Post-eligibility: Ability and willingness to take oral study medications]